acute myocardial infarction, heart failure, neoplastic disease, chronic diseases that may affect the inflammatory profile both systemic and epicardial (cancer, chronic intestinal inflammation, hepatitis, AIDS); life expectancy < 6 months, previous CABG and/or other open heart surgery intervention, acute coronary syndrome

The above is a clinical trial exclusion criterion. Annotated with entity spans:
[Condition: acute myocardial infarction], [Condition: heart failure], [Condition: neoplastic disease], [Condition: chronic diseases] that [Qualifier: may affect the inflammatory profile] both [Qualifier: systemic] and [Qualifier: epicardial] ([Condition: cancer], [Condition: chronic intestinal inflammation], [Condition: hepatitis], [Condition: AIDS]); [Observation: life expectancy] [Value: < 6 months], [Temporal: previous] [Procedure: CABG] and/or [Qualifier: other] [Procedure: open heart surgery intervention], [Condition: acute coronary syndrome]